Clinical trial exclusion criterion:
Presence of any systemic disease that could alter the production or composition of saliva.

Entity relations:
- Has_qualifier("systemic disease", "could alter the production or composition of saliva")